Clinical trial exclusion criterion:
Participation in a CHF training program.

Annotated entities:
- Non-query-able: "Participation in a CHF training program."